Clinical trial exclusion criterion:
Anticoagulant use (warfarin or heparin)

Annotated entities:
- Drug: "Anticoagulant"
- Drug: "warfarin"
- Drug: "heparin"